El acoplamiento de un alquino terminal con haluro de vinilo mediante catálisis con paladio se conoce como reacción de:
1. Heck.
2. Suzuki.
3. Sonogashira.
4. Stille.
5. Nicolaou.

Respuesta correcta: 3. Sonogashira.